下列那種疾病最不可能出現奇脈（pulsus paradoxus）？
A. 低血容量休克（hypovolemic shock）
B. 二尖瓣閉鎖不全（mitral regurgitation）
C. 心包膜填塞（pericardial tamponade）
D. 慢性阻塞性肺疾（chronic obstructive pulmonary disease）

正確答案：B. 二尖瓣閉鎖不全（mitral regurgitation）